下列那一個胺基酸在 pH 等於 11 時帶一個淨負電荷？
A. 精胺基酸（arginine）
B. 天冬胺基酸（aspartic acid）
C. 麩胺基酸（glutamic acid）
D. 絲胺基酸（serine）

正確答案：D. 絲胺基酸（serine）